Clinical trial inclusion criterion:
5. Subjects must report menstrual periods occurring within 21-60 days from the start of one period to the start of the next menstrual period

Entity relations:
- Has_temporal("menstrual periods", "within 21-60 days from the start of one period")
- Has_index("within 21-60 days from the start of one period", "the start of one period")